Clinical trial exclusion criterion:
Known history or present abuse of alcohol or drugs

Annotated entities:
- Temporal: "history"
- Temporal: "present"
- Condition: "abuse of alcohol"
- Condition: "abuse of drugs"